Clinical trial exclusion criterion:
An oral temperature >100.4° or acute disease within 72 hours prior to vaccination, defined as the presence of a moderate or severe illness (as determined by the investigator through medical history and physical examination; for example, those requiring an absence from work) with or without fever.

Entity relations:
- Has_value("oral temperature", ">100.4°")
- Has_index("within 72 hours prior to vaccination", "vaccination")
- Has_temporal("oral temperature", "within 72 hours prior to vaccination")
- OR("oral temperature", "acute disease")
- OR("moderate illness", "severe illness")